Clinical trial exclusion criterion:
indication for catheter insertion;

Entity relations:
- Has_mood("catheter insertion", "indication")